病患若有膀胱過動症（overactive bladder），下列何種治療方式應最先被採用？
A. 抗膽鹼藥物（anticholinergic medications）
B. 行為治療（behavioral modification）
C. α-agonist medications
D. 經陰道電刺激法（electric stimulation）

正確答案：B. 行為治療（behavioral modification）